樹突細胞為重要的專業抗原呈現細胞，其由周邊組織移動至淋巴結時，細胞表面分子會出現變化，下列相關敘述何者正確？
A. 在周邊的未成熟樹突細胞具有較強的吞噬能力，是因為表現高量的 CD11c 分子
B. 樹突細胞在周邊攝入病原體後，會遷移至附近淋巴結是因為樹突細胞會表現 CCR7 分子
C. 病原體會刺激未成熟樹突細胞轉變為成熟形式，而成熟的樹突細胞會表現大量的 MHC class II 分子與少量的 B7 分子，來幫助活化 T 細胞
D. 當成熟的樹突細胞活化T細胞時，可以分泌IL-10 來幫助T細胞分化變成第一型輔助性T細胞（TH1

正確答案：B. 樹突細胞在周邊攝入病原體後，會遷移至附近淋巴結是因為樹突細胞會表現 CCR7 分子